Clinical trial inclusion criterion:
Age =1 year, stratified into different age groups

Annotated entities:
- Person: "Age"
- Value: "=1 year"
- Non-representable: "stratified into different age groups"